Clinical trial exclusion criterion:
Atrioventricular block of second or third degree (without a pacemaker).

Entity relations:
- Has_negation("pacemaker", "without")
- OR("Atrioventricular block of second degree", "Atrioventricular block of third degree")